¿Cuál es la principal causa de incontinencia urinaria funcional en las personas ancianas?
1. Inestabilidad del detrusor.
2. Obstrucción por fecalomas.
3. Laxitud de la musculatura del suelo de la pelvis.
4. Barreras medioambientales.
5. Retención urinaria inducida por la medicación.

Respuesta correcta: 4. Barreras medioambientales.